Paciente de 68 años tiene una masa tumoral diagnosticada de carcinoma pulmonar no células pequeñas en el bronquio principal derecho a 1 cm de la carina traqueal. En la mediastinoscopia se aprecian adenopatías contralaterales    que son positivas. El tratamiento recomendado sería:
1. Quimioterapia      previa     neumonectomía derecha.
2. Cirugía y radioterapia posterior de todas las cadenas ganglionares afectas.
3. Neumonectomía derecha y quimioterapia posterior.
4. Quimioterapia y radioterapia.
5. Radioterapia.

Respuesta correcta: 4. Quimioterapia y radioterapia.